Clinical trial exclusion criterion:
Any patients contraindicated for vaginal delivery

Entity relations:
- AND("contraindicated", "vaginal delivery")